Hypersensitivity to morphine, naltrexone.

The above is a clinical trial exclusion criterion. Annotated with entity spans:
[Condition: Hypersensitivity] to [Drug: morphine], [Drug: naltrexone].